當一位健康新生兒出生數小時內發生皮膚壞死性紫斑（necrotic purpura）及血管栓塞的 neonatal purpura fulminans，最可能是下列那一種遺傳性疾病？
A. Protein C 缺乏
B. Protein S 缺乏
C. 血友病（hemophilia）
D. von Willebrand 病

正確答案：A. Protein C 缺乏